Clinical trial exclusion criterion:
5. Clinically relevant laboratory abnormalities (e.g. Hgb<11g/dL, Hct<30g/dL, total cholesterol >240mg/dL, triglycerides >500mg/dL, fasting glucose >130mg/dL, liver function tests >2.5x upper limit of normal, baseline international normalized ratio >1.2)

Annotated entities:
- Parsing_Error: "5."
- Qualifier: "Clinically relevant"
- Undefined_semantics: "Clinically relevant"
- Condition: "laboratory abnormalities"
- Measurement: "Hgb"
- Value: "<11g/dL"
- Measurement: "Hct"
- Measurement: "total cholesterol"
- Measurement: "triglycerides"
- Measurement: "fasting glucose"
- Measurement: "liver function tests"
- Value: ">2.5x upper limit of normal"
- Measurement: "international normalized ratio"
- Value: ">1.2"
- Temporal: "baseline"
- Value: ">130mg/dL"
- Value: ">500mg/dL"
- Value: ">240mg/dL"
- Value: "<30g/dL"
- Undefined_semantics: "laboratory abnormalities"
- Subjective_judgement: "Clinically relevant"